Clinical trial inclusion criterion:
Sufficient number of umbilical cord blood units available for transplantation

Annotated entities:
- Measurement: "umbilical cord blood units available"
- Value: "Sufficient number"
- Qualifier: "for transplantation"
- Procedure: "transplantation"